Clinical trial exclusion criterion:
HBsAg negative at baseline

Entity relations:
- Has_temporal("HBsAg negative", "at baseline")